一位 50 歲女性被發現有血液相異常，其血紅素為 13 gm/dL，白血球數為 25,500 /µL，分類如下：blast  5%, myelocyte 4%, metamyelocyte 7.5%, band 17%, segmented neutrophil 54.5%, monocyte 2.5%, lymphocyte 8%, basophil 2.5%, eosinophil 1.5%，血小板數為 445,000 /µL；白血球鹼性磷酸酶點數（LAP score）為 12。則此病人最可能得的病是：
A. Metastatic carcinoma
B. Systemic infection
C. Chronic myeloid leukemia
D. Acute myeloid leukemia

正確答案：C. Chronic myeloid leukemia